hemodynamically unstable heart failure

The above is a clinical trial exclusion criterion. Annotated with entity spans:
[Qualifier: hemodynamically unstable] [Condition: heart failure]